Clinical trial inclusion criterion:
elective primary total knee arthroplasty

Entity relations:
- Has_qualifier("total knee arthroplasty", "primary")
- Has_qualifier("total knee arthroplasty", "elective")